Clinical trial exclusion criterion:
Presentation with acute liver failure, defined as presence of hepatic encephalopathy and coagulopathy (INR > 1.5)

Annotated entities:
- Condition: "acute liver failure"
- Condition: "hepatic encephalopathy"
- Condition: "coagulopathy"
- Measurement: "INR"
- Value: "> 1.5"